Clinical trial inclusion criterion:
Severe heart, lung and central nervous system disorders.

Annotated entities:
- Qualifier: "Severe"
- Condition: "heart disorders"
- Condition: "lung disorders"
- Condition: "entral nervous system disorders"